¿Cuál es una de las diferencias entre enfermos de Alzheimer y subcorticales (especialmente Huntington y Parkinson)?
1. La capacidad para codificar semánticamente la información parece preservada en las subcorticales, mientras que Alzheimer parece bastante deteriorada.
2. Hay mayor pérdida de la memoria de reconocimiento en las subcorticales.
3. La tasa de olvido es más lenta en Alzheimer.
4. La amnesia retrograda está graduada temporalmente en enfermos subcorticales.
5. Hay menor pérdida de la memoria de reconocimiento en Alzheimer.

Respuesta correcta: 1. La capacidad para codificar semánticamente la información parece preservada en las subcorticales, mientras que Alzheimer parece bastante deteriorada.